Which cell type has the protein Chromogranin A as marker?

Chromogranin A is a marker for neuroendocrine cells